下列有關膝前十	韌帶（anterior cruciate ligament）斷裂的敘述，何者錯誤？
A. 疼痛是急性期最常見的症狀
B. 冰敷、抬高、壓迫是急性期重要的處理方法
C. 拉赫曼試	（Lachman's test）比前拉試	（anterior drawer test）敏感
D. 對於運動選手，建議在受傷1～2週後才進行重建手術

正確答案：A. 疼痛是急性期最常見的症狀